Which drugs are in the Segluromet combination pill?

Segluromet includes combinations of ertugliflozin and metformin. It has recently been approved by the US FDA as an adjunct to diet and exercise to improve glycaemic control in adults with T2DM.